Clinical trial exclusion criterion:
prisoner

Annotated entities:
- Person: "prisoner"